Clinical trial exclusion criterion:
GFR (MDRD) < 40 ml/min;

Entity relations:
- Has_value("GFR", "< 40 ml/min")